¿Cuál de los siguientes antiinfecciosos puede producir aumento de la CPK asociado a dolores musculares y rabdomiolisis?
1. Amikacina.
2. Daptomicina.
3. Vancomicina.
4. Linezolid.
5. Aztreonam.

Respuesta correcta: 2. Daptomicina.